5. Abnormal and clinically significant laboratory test results:

The above is a clinical trial exclusion criterion. Annotated with entity spans:
[Parsing_Error: 5.] [Parsing_Error: Abnormal and clinically significant laboratory test results:]